Has had clinically diagnosed hepatic encephalopathy in the last 6 months

The above is a clinical trial exclusion criterion. Annotated with entity spans:
Has had clinically diagnosed [Condition: hepatic encephalopathy] [Temporal: in the last 6 months]